Clinical trial exclusion criterion:
participant taken an opioid or an opioid like analgesic within 24 hours

Entity relations:
- Has_temporal("opioid", "within 24 hours")
- OR("opioid", "opioid like analgesic")